位於蝶骨大翼（greater wing）與小翼（lesser wing）間的構造為：
A. 視神經孔（optic foramen）
B. 眶上裂（superior orbital fissure）
C. 圓孔（foramen rotundum）
D. 眶下裂（inferior orbital fissure）

正確答案：B. 眶上裂（superior orbital fissure）